Clinical trial exclusion criterion:
any medical or surgical intervention planned for the next 13 months after randomization not allowing study participation according to the investigator´s judgment

Annotated entities:
- Non-query-able: "ny medical or surgical intervention planned for the next 13 months after randomization not allowing study participation according to the investigator´s judgment"